Clinical trial exclusion criterion:
History of heparin-induced thrombocytopenia (HIT)

Entity relations:
- Has_temporal("heparin-induced thrombocytopenia (HIT)", "History")